Pregnant or breast-feeding subjects

The above is a clinical trial exclusion criterion. Annotated with entity spans:
[Condition: Pregnant] or [Condition: breast-feeding] subjects